Clinical trial exclusion criterion:
Known hepatitis B surface antigen-positive, or known or suspected active hepatitis C infection

Entity relations:
- Has_qualifier("hepatitis C infection", "active")
- Has_value("hepatitis B surface antigen", "positive")
- OR("hepatitis B surface antigen", "hepatitis C infection")